Clinical trial exclusion criterion:
Physical disabilities that prohibit task performance (such as blindness or deafness)

Annotated entities:
- Subjective_judgement: "Physical disabilities that prohibit task performance"
- Condition: "blindness"
- Condition: "deafness"